Clinical trial exclusion criterion:
Patients with a history of anaphylactic allergy to eggs or egg products, manifested by one or more of the following symptoms: generalized urticaria, difficulty in breathing, swelling of the mouth and throat, hypotension, or shock. (Subjects with nonanaphylactic allergies to eggs or egg products may be enrolled in the study, but must be watched carefully for 1 h following the administration of SONAZOID).

Annotated entities:
- Condition: "anaphylactic allergy"
- Drug: "eggs"
- Drug: "egg products"
- Condition: "generalized urticaria"
- Condition: "difficulty in breathing"
- Condition: "swelling of the mouth"
- Condition: "swelling of the throat"
- Condition: "hypotension"
- Condition: "shock"